Current or past history of any significant psychiatric disorder including, but not limited to, depression (treatment with antidepressants), bipolar disorder, or schizophrenia.

The above is a clinical trial exclusion criterion. Annotated with entity spans:
Current or past history of any [Qualifier: significant] [Condition: psychiatric disorder] including, but not limited to, [Condition: depression] (treatment with [Drug: antidepressants]), [Condition: bipolar disorder], or [Condition: schizophrenia].